Gastrointestinal ulcer or tumor

The above is a clinical trial exclusion criterion. Annotated with entity spans:
[Condition: Gastrointestinal ulcer] or tumor